Patients experiencing an average weekly pain intensity score greater than 4 on a 11 points NRS

The above is a clinical trial inclusion criterion. Annotated with entity spans:
Patients experiencing an [Measurement: average weekly pain intensity score] [Value: greater than 4] on a 11 points NRS